Nephrotic range proteinuria (urinary protein > 3.5 gm/day)

The above is a clinical trial exclusion criterion. Annotated with entity spans:
[Qualifier: Nephrotic range] [Condition: proteinuria] ([Measurement: urinary protein] [Value: > 3.5 gm/day])